Clinical trial exclusion criterion:
Abnormal liver enzymes (Aspartate transaminase (AST), Alanine transaminase (ALT), or alkaline phosphatase > 2.5 times the upper limit of normal)

Entity relations:
- Has_value("Aspartate transaminase (AST)", "> 2.5 times the upper limit of normal")
- Has_value("liver enzymes", "Abnormal")
- Subsumes("liver enzymes", "Aspartate transaminase (AST)")
- OR("Aspartate transaminase (AST)", "Alanine transaminase (ALT)", "alkaline phosphatase")